Clinical trial exclusion criterion:
Combined P-glycoprotein and strong cytochrome P450 (CYP) 3A4 inhibitor

Annotated entities:
- Drug: "P-glycoprotein inhibitor"
- Drug: "cytochrome P450 3A4 inhibitor"
- Qualifier: "strong"